regular herbal medicine or antioxidant supplementation.

The above is a clinical trial exclusion criterion. Annotated with entity spans:
regular [Procedure: herbal medicine] or [Drug: antioxidant supplementation].